肝臟最常見的良性腫瘤為：
A. 血管瘤（hemangioma）
B. 腺瘤（adenoma）
C. 局部結節增生（focal nodular hyperplasia）
D. 淋巴瘤（lymphoma）

正確答案：A. 血管瘤（hemangioma）